Clinical trial exclusion criterion:
Cardiac or neurologic active medical condition, including past CVA/TIA (Cardiovascular Accident/Transient Ischemic Attack) or any other unstable medical condition.

Annotated entities:
- Condition: "neurologic active medical condition"
- Condition: "Cardiac active medical condition"
- Condition: "CVA"
- Condition: "TIA"
- Temporal: "past"
- Condition: "Cardiovascular Accident"
- Condition: "Transient Ischemic Attack"
- Qualifier: "unstable"
- Condition: "medical condition"